Clinical trial exclusion criterion:
Inadequate understanding about the study

Annotated entities:
- Observation: "Inadequate understanding about the study"